Clinical trial exclusion criterion:
History or known presence of central nervous system (CNS) or spinal cord tumor (e.g., meningioma, glioma)

Annotated entities:
- Condition: "central nervous system (CNS) tumor"
- Condition: "spinal cord tumor"
- Condition: "meningioma"
- Condition: "glioma"